Clinical trial exclusion criterion:
Unwilling to discontinue anti-TNF agent

Entity relations:
- AND("discontinue", "anti-TNF agent")
- Has_mood("discontinue", "Unwilling")